Clinical trial inclusion criterion:
Score 26 or higher on the Montreal Cognitive Assessment

Entity relations:
- Has_value("Montreal Cognitive Assessment", "26 or higher")